一位有多年酗酒史的 30 歲男性，三天前因喝酒後發生劇烈上腹部疼痛症狀持續沒改善而至急診室就醫，身體檢查發現上腹部有壓痛與輕微的反彈痛，病人有輕微發燒（38.1℃），血液檢查白血球 16500/μL，血色素 10.5g /dL，腹部電腦斷層發現胰臟發炎，胰臟旁邊有液體存留。請問下一步最適切的處置決策為何？
A. 直接剖腹手術並行胰臟清創手術
B. 立即安排逆行性膽道攝影
C. 由電腦斷層引導下抽取胰臟旁液體做檢驗，細菌培養
D. 行腹腔鏡手術並引流液體

正確答案：C. 由電腦斷層引導下抽取胰臟旁液體做檢驗，細菌培養